8. Patients on methotrexate.

The above is a clinical trial exclusion criterion. Annotated with entity spans:
8. Patients on [Drug: methotrexate].